Clinical trial exclusion criterion:
Pregnant or lactating women and female volunteers of childbearing potential (except for women who are surgically sterile) who are not willing to use an adequate method of contraception (oral contraceptives, intrauterine device, condom, etc.) during the study. Women of childbearing potential who are not surgically sterile will be allowed to participate in the study only if they have negative pregnancy test at Visit 1 (screening) and should continue to use medically acceptable method of contraception (basic body temperature method and rhythm method will not be allowed). Women with no menses for = 12 months will be considered as postmenopausal state and method of contraception using hormonal contraception such as oral contraceptive should be initiated from or prior to the screening.

Entity relations:
- Has_negation("willing to", "not")
- Has_mood("adequate method of contraception", "willing to")
- AND("Pregnant", "adequate method of contraception")
- AND("women", "adequate method of contraception")
- AND("childbearing potential", "adequate method of contraception")
- OR("Pregnant", "lactating")
- OR("women", "female")